Clinical trial inclusion criterion:
6-min walk of > 50m (without rehabilitation) or > 100m (with rehabilitation)

Annotated entities:
- Measurement: "6-min walk"
- Value: "> 50m"
- Value: "> 100m"
- Negation: "without"
- Qualifier: "rehabilitation"
- Qualifier: "rehabilitation"